Clinical trial exclusion criterion:
Dilantin and oral contraceptive usage due to potential drug interaction with glitazones

Entity relations:
- Has_mood("drug interaction", "potential")
- AND("Dilantin", "drug interaction")
- AND("drug interaction", "glitazones")
- OR("Dilantin", "oral contraceptive")